一新生兒發生非常嚴重乳酸中毒（lactic acidosis），進一步檢查發現有丙酮酸脫氫酵素（pyruvate dehydrogenase）缺乏，下列敘述何者正確？
A. 在有氧狀況下，丙酮酸轉化為乳酸（lactic acid）及乙醇（ethanol）
B. 在無氧狀況下，丙酮酸在粒線體轉化為乙醯輔酶A（acetyl-CoA）
C. 丙酮酸脫氫酵素是由三種酵素複合體結合而成
D. 神經系統不會受到影響

正確答案：C. 丙酮酸脫氫酵素是由三種酵素複合體結合而成